Clinical trial inclusion criterion:
Regular menstruation cycle

Annotated entities:
- Condition: "Regular menstruation cycle"